呼吸器官的原基（respiratory primordium）起源於下列何者的尾端（caudal end）？
A. 第一咽囊（pharyngeal pouch）
B. 第二咽囊（pharyngeal pouch）
C. 第三咽囊（pharyngeal pouch）
D. 第四咽囊（pharyngeal pouch）

正確答案：D. 第四咽囊（pharyngeal pouch）